What are the results of loss of the protein Lon1 in the plant Arabidopsis?

Loss of Lon1 in Arabidopsis changes the mitochondrial proteome leading to altered metabolite profiles and growth retardation. Additionaly, seedling establishment is also impaired.